How many annotated conserved human lncRNAs come from ancestral protein-coding genes?

~ 55